Clinical trial exclusion criterion:
Systolic pressure =180 mmHg or diastolic pressure =110 mmHg;

Annotated entities:
- Measurement: "Systolic pressure"
- Value: "=180 mmHg"
- Measurement: "diastolic pressure"
- Value: "=110 mmHg"